Clinical trial exclusion criterion:
Current severe, uncontrolled systemic disease (eg, clinically significant cardiovascular, pulmonary, or metabolic disease; wound healing disorders; ulcers; or bone fractures).

Entity relations:
- Has_qualifier("cardiovascular disease", "clinically significant")
- Has_qualifier("systemic disease", "uncontrolled")
- Has_qualifier("systemic disease", "severe")
- AND("cardiovascular disease", "systemic disease")
- OR("cardiovascular disease", "bone fractures", "wound healing disorders", "ulcers")
- OR("cardiovascular disease", "metabolic disease", "pulmonary disease")